Clinical trial inclusion criterion:
Subject has been diagnosed with symptomatic paroxysmal atrial fibrillation as defined above and at least two symptomatic episodes in the last six months prior to inclusion.

Annotated entities:
- Condition: "paroxysmal atrial fibrillation"
- Qualifier: "symptomatic"
- Multiplier: "at least two"
- Condition: "episodes"
- Qualifier: "symptomatic"
- Temporal: "last six months prior to inclusion"
- Reference_point: "inclusion"